Clinical trial inclusion criterion:
Subject must meet all required subject suitability criteria that pertain to normal source plasma donors.

Annotated entities:
- Undefined_semantics: "Subject must meet all required subject suitability criteria that pertain to normal source plasma donors."